Clinical trial inclusion criteria:
Healthy
Male
>7 Metabolic Equivalents
Written informed consent
Chronic pain syndrome
Drug abuse
Alcohol abuse
Suspicion of neurologic dysfunction at tested sites
Ongoing treatment with antidepressants
Ongoing treatment with analgesics
Pretreatment with any CYP3A inducers or inhibitors
Known allergy to tested drugs
Elevated eye pressure
Obstructive uropathy
Heart disease
Pulmonary disease
Neurological disease
Psychiatric illness

Annotated entities:
- Value: "Healthy"
- Person: "Male"
- Value: ">7"
- Measurement: "Metabolic Equivalents"
- Informed_consent: "Written informed consent"
- Condition: "Chronic pain syndrome"
- Condition: "Drug abuse"
- Condition: "Alcohol abuse"
- Mood: "Suspicion"
- Condition: "neurologic dysfunction"
- Qualifier: "tested sites"
- Temporal: "Ongoing"
- Procedure: "treatment"
- Drug: "antidepressants"
- Temporal: "Ongoing"
- Procedure: "treatment"
- Drug: "analgesics"
- Procedure: "Pretreatment"
- Drug: "CYP3A inducers"
- Drug: "CYP3A inhibitors"
- Condition: "allergy"
- Drug: "tested drugs"
- Condition: "Elevated eye pressure"
- Condition: "Obstructive uropathy"
- Condition: "Heart disease"
- Condition: "Pulmonary disease"
- Condition: "Neurological disease"
- Condition: "Psychiatric illness"